Clinical trial inclusion criteria:
Male or female patients age 18 years or older, with relapsed or refractory sALCL who have previously received at least 1 multiagent chemotherapy
Bidimensional measurable disease
An Eastern Cooperative Oncology Group (ECOG) performance status of 0 or 1
Female patients who are postmenopausal for at least 1 year before the screening visit, surgically sterile, or agree to practice 2 effective methods of contraception, at the same time, from the time of signing the informed consent form through 30 days after the last dose of study drug, or agree to practice true abstinence
Male patients who agree to practice effective barrier contraception during the entire study treatment period through 6 months after the last dose of study drug or agree to practice true abstinence
Clinical laboratory values as specified in the study protocol

Annotated entities:
- Person: "Male"
- Person: "female"
- Person: "age"
- Value: "18 years or older"
- Condition: "sALCL"
- Qualifier: "refractory"
- Qualifier: "relapsed"
- Multiplier: "at least 1"
- Procedure: "chemotherapy"
- Non-query-able: "Bidimensional measurable disease"
- Measurement: "Eastern Cooperative Oncology Group performance status"
- Measurement: "ECOG"
- Value: "0 or 1"
- Pregnancy_considerations: "Female patients who are postmenopausal for at least 1 year before the screening visit, surgically sterile, or agree to practice 2 effective methods of contraception, at the same time, from the time of signing the informed consent form through 30 days after the last dose of study drug, or agree to practice true abstinence"
- Pregnancy_considerations: "Male patients who agree to practice effective barrier contraception during the entire study treatment period through 6 months after the last dose of study drug or agree to practice true abstinence"
- Non-query-able: "Clinical laboratory values as specified in the study protocol"